En el transcurso de la entrevista de un paciente, usted cae en la cuenta de que no está entendiendo lo que el paciente le dice. Decide centrar su atención en el discurso y se da cuenta de que éste no tiene una idea directriz a pesar de que fragmentos concretos del mismo resultan comprensibles. Esta alteración del lenguajepensamiento, típica por otro lado de la esquizofrenia, es lo que en psicopatología se conoce como:
1. Disociación del pensamiento.
2. Fuga de ideas.
3. Lenguaje perseverante.
4. Desorganización del pensamiento.
5. Bloqueo del pensamiento.

Respuesta correcta: 4. Desorganización del pensamiento.